Clinical trial inclusion criterion:
Prior treatment for lymphoid malignancy for progressive /refractory disease

Annotated entities:
- Temporal: "Prior"
- Procedure: "treatment"
- Condition: "lymphoid malignancy"
- Condition: "refractory disease"
- Condition: "progressive disease"